Patients with important organ dysfunctions.

The above is a clinical trial exclusion criterion. Annotated with entity spans:
Patients with important [Condition: organ dysfunctions].